Clinical trial exclusion criterion:
History of thrombocytopenia or neutropenia

Annotated entities:
- Condition: "thrombocytopenia"
- Condition: "neutropenia"
- Temporal: "History"